Clinical trial inclusion criterion:
Informed consent signed.

Annotated entities:
- Observation: "Informed consent signed"